Clinical trial inclusion criterion:
3. Pulmonary vascular resistance (PVR) ≥300 dyn•s/cm5 (3.75 Wood units)

Annotated entities:
- Parsing_Error: "3."
- Condition: "Pulmonary vascular resistance (PVR)"
- Value: "≥300 dyn•s/cm5"
- Value: "3.75 Wood units"